Presence of intracardiac thrombus, myxoma, tumor, interatrial baffle or patch or other abnormality that precludes vascular access, or manipulation of the catheter.

The above is a clinical trial exclusion criterion. Annotated with entity spans:
Presence of [Condition: intracardiac thrombus], [Condition: myxoma], [Condition: tumor], [Condition: interatrial baffle] or [Device: patch] or [Qualifier: other] [Condition: abnormality] that [Condition: precludes] [Procedure: vascular access], or [Procedure: manipulation of the catheter].